Clinical trial exclusion criterion:
Planned bariatric surgery during the study or prior bariatric surgical procedures

Annotated entities:
- Mood: "Planned"
- Procedure: "bariatric surgery"
- Temporal: "during the study"
- Reference_point: "the study"
- Temporal: "prior"
- Procedure: "bariatric surgical procedures"